Rapid-antigen detection test (RADT) positive for GAS-

The above is a clinical trial inclusion criterion. Annotated with entity spans:
[Measurement: Rapid-antigen detection test] ([Measurement: RADT]) [Value: positive] for [Qualifier: GAS-]